Have had recent ST elevation myocardial infarction or non-ST elevation MI (< 30 days); note that biomarker elevation alone after ventricular arrhythmias does not denote MI.

The above is a clinical trial exclusion criterion. Annotated with entity spans:
Have had recent [Condition: ST elevation myocardial infarction] or [Condition: non-ST elevation MI] ([Temporal: < 30 days]); n[Non-query-able: ote that biomarker elevation alone after ventricular arrhythmias does not denote MI].